Clinical trial exclusion criterion:
Implanted neural stimulator

Annotated entities:
- Device: "Implanted neural stimulator"